Patients presenting midline hernia.

The above is a clinical trial exclusion criterion. Annotated with entity spans:
Patients presenting [Condition: midline hernia].